Clinical trial inclusion criterion:
Newborns weighing 1.5kg or more at birth

Annotated entities:
- Person: "Newborns"
- Measurement: "weighing"
- Value: "1.5kg or more"
- Temporal: "at birth"